Clinical trial exclusion criterion:
Subject has any history of successful or unsuccessful treatment of AF with class I or III antiarrhythmic or sotalol with the intention to prevent an AF recurrence. Patients pretreated with above AAD at maximum 48 hours with the intention to convert an AF episode are allowed.

Entity relations:
- Has_qualifier("antiarrhythmic", "class I")
- AND("AF", "antiarrhythmic")
- OR("class I", "class III")
- OR("antiarrhythmic", "sotalol")